Clinical trial exclusion criterion:
Complications to RYGB. Documented reactive hypoglycaemia, severe dumping (vomiting, diarrhea, severe abdominal pain after food intake)

Annotated entities:
- Condition: "Complications"
- Procedure: "RYGB"
- Condition: "reactive hypoglycaemia"
- Qualifier: "severe"
- Condition: "dumping"
- Condition: "vomiting"
- Condition: "diarrhea"
- Qualifier: "severe"
- Condition: "abdominal pain"
- Temporal: "after food intake"
- Reference_point: "food intake"